Which method is behind HipMCL?

HipMCL is a high-performance parallel implementation of the Markov clustering algorithm for large-scale networks.